Patients (or legal representative) willing and able to provide written Informed Consent Form.

The above is a clinical trial inclusion criterion. Annotated with entity spans:
[Informed_consent: Patients (or legal representative) willing and able to provide written Informed Consent Form].